El óxido ferroso, conocido como wustita (FeO) es no estequiométrico debido a que contiene:
1. Exceso de hierro.
2. Exceso de oxígeno.
3. Defecto de hierro.
4. Defecto de oxígeno.
5. Defecto de hierro y oxígeno.

Respuesta correcta: 3. Defecto de hierro.